Clinical trial exclusion criteria:
Has bilateral sacroiliitis Grade 2 or unilateral sacroiliitis Grade 3 or Grade 4
Is a nursing or pregnant female, or intends to become pregnant within 6 months after receiving trial medication
Intends to donate eggs (female participants) or sperm (male participants) while receiving trial medication or within 6 months after trial medication
Has any clinically significant condition or situation that would interfere with the trial evaluations or participation in the trial
Has ever received any cytotoxic drugs, including chlorambucil, cyclophosphamide, nitrogen mustard, or other alkylating agents
• Disease-modifying anti-rheumatic drugs (30 days off drug)
• Live vaccinations (3 months off drug)
• Investigational medications (30 days or 5 half-lives off drug, whichever is longer)
• Bacille Calmette-Guerin (BCG) vaccination (12 months off drug)
Has any systemic inflammatory condition, including psoriatic arthritis, active Lyme disease, systemic lupus erythematosus, infectious arthritis, vasculitis, parvovirus infection, rheumatoid arthritis, active uveitis, or active IBD
Has a history of latent or active granulomatous infection prior to Screening
Had a nontuberculous mycobacterial infection or opportunistic infection within 6 months prior to Screening
Has a history of an infected joint prosthesis, or has received antibiotics for a suspected infection of a joint prosthesis, if that prosthesis has not been removed or replaced
Had a serious infection, has been hospitalized for an infection, or has been treated with IV antibiotics for an infection within 2 months prior to Baseline
Had a history of, or ongoing, chronic or recurrent infectious disease
Is known to be infected with human immunodeficiency virus (HIV) or seropositive for hepatitis C virus (HCV)
Has had a chest x-ray within 2 months prior to Screening that shows an abnormality suggestive of a current active infection or malignancy
Has a history of lymphoproliferative disease
Has had a malignancy within 5 years before screening (exceptions are squamous and basal cell carcinomas of the skin and carcinoma in situ of cervix that has been surgically cured)
Has a history of known demyelinating diseases such as multiple sclerosis or optic neuritis
Has a history of or concurrent congestive heart failure of any grade
Has a transplanted organ (with the exception of a corneal transplant performed >= 3 months prior to baseline)
Has current signs or symptoms of significant medical illness which could interfere with the trial, or require treatment that might interfere with the trial
Is a user of recreational or illicit drugs or has or had a substance abuse (drug or alcohol) problem within the previous 2 years

Annotated entities:
- Qualifier: "bilateral"
- Condition: "sacroiliitis"
- Qualifier: "Grade 2"
- Qualifier: "unilateral"
- Condition: "sacroiliitis"
- Qualifier: "Grade 3"
- Qualifier: "Grade 4"
- Condition: "nursing"
- Condition: "pregnant"
- Person: "female"
- Condition: "pregnant"
- Temporal: "within 6 months after receiving trial medication"
- Mood: "intends to become"
- Procedure: "donate eggs"
- Procedure: "donate sperm"
- Person: "female"
- Person: "male"
- Temporal: "while receiving trial medication"
- Temporal: "within 6 months after trial medication"
- Reference_point: "trial medication"
- Reference_point: "trial medication"
- Post-eligibility: "Has any clinically significant condition or situation that would interfere with the trial evaluations or participation in the trial"
- Drug: "cytotoxic drugs"
- Drug: "chlorambucil"
- Drug: "cyclophosphamide"
- Drug: "nitrogen mustard"
- Drug: "alkylating agents"
- Drug: "Disease-modifying anti-rheumatic drugs"
- Temporal: "30 days off drug"
- Drug: "Live vaccinations"
- Temporal: "3 months off drug"
- Drug: "Investigational medications"
- Temporal: "30 days off drug"
- Temporal: "5 half-lives off drug"
- Drug: "Bacille Calmette-Guerin (BCG) vaccination"
- Temporal: "12 months off drug"
- Condition: "inflammatory condition"
- Condition: "psoriatic arthritis"
- Condition: "Lyme disease"
- Qualifier: "active"
- Condition: "systemic lupus erythematosus"
- Condition: "infectious arthritis"
- Condition: "vasculitis"
- Condition: "parvovirus infection"
- Condition: "rheumatoid arthritis"
- Condition: "active uveitis"
- Condition: "active IBD"
- Qualifier: "active"
- Qualifier: "latent"
- Condition: "granulomatous infection"
- Temporal: "prior to Screening"
- Reference_point: "Screening"
- Condition: "nontuberculous mycobacterial infection"
- Condition: "opportunistic infection"
- Temporal: "within 6 months prior to Screening"
- Condition: "infected"
- Device: "joint prosthesis"
- Temporal: "history"
- Drug: "antibiotics"
- Mood: "suspected"
- Condition: "infection"
- Device: "joint prosthesis"
- Condition: "serious infection"
- Procedure: "hospitalized"
- Condition: "infection"
- Drug: "IV antibiotics"
- Condition: "infection"
- Temporal: "within 2 months prior to Baseline"
- Qualifier: "recurrent"
- Qualifier: "chronic"
- Temporal: "ongoing"
- Temporal: "history"
- Condition: "infectious disease"
- Condition: "human immunodeficiency virus (HIV)"
- Condition: "seropositive for hepatitis C virus (HCV)"
- Procedure: "chest x-ray"
- Temporal: "within 2 months prior to Screening"
- Condition: "abnormality"
- Mood: "suggestive"
- Temporal: "current"
- Qualifier: "active"
- Condition: "infection"
- Condition: "malignancy"
- Reference_point: "Screening"
- Condition: "lymphoproliferative disease"
- Condition: "malignancy"
- Temporal: "within 5 years before screening"
- Reference_point: "screening"
- Condition: "squamous carcinomas of the skin"
- Condition: "basal cell carcinomas of the skin"
- Condition: "carcinoma in situ"
- Qualifier: "cervix"
- Qualifier: "surgically cured"
- Procedure: "surgically"
- Negation: "exceptions"
- Condition: "demyelinating diseases"
- Temporal: "history"
- Condition: "multiple sclerosis"
- Condition: "optic neuritis"
- Condition: "congestive heart failure"
- Temporal: "concurrent"
- Temporal: "history"
- Procedure: "transplanted organ"
- Procedure: "corneal transplant"
- Temporal: ">= 3 months prior to baseline"
- Negation: "exception of"
- Condition: "medical illness"
- Qualifier: "significant"
- Observation: "interfere with the trial"
- Mood: "require"
- Procedure: "treatment"
- Observation: "interfere with the trial"
- Intoxication_considerations: "Is a user of recreational or illicit drugs or has or had a substance abuse (drug or alcohol) problem within the previous 2 years"